下列關於 protein kinase A 的敘述，何者正確？
A. 受 cyclic GMP 的調控進行活化
B. 受 AMP 的調控進行活化
C. 受 cyclic AMP 的調控進行活化
D. Protein kinase A 的活化可促進細胞內脂肪酸的生合成（fatty acid biosynthesis）

正確答案：C. 受 cyclic AMP 的調控進行活化